Has physician-diagnosed active nr-axSpA with disease duration <= 5 years

The above is a clinical trial inclusion criterion. Annotated with entity spans:
Has physician-diagnosed [Qualifier: active] [Condition: nr-axSpA] with [Qualifier: disease duration <= 5 years]